Which is the most common monogenic cause of common variable immunodeficiency (CVID) in Europeans?

Heterozygous loss-of-function variants in NFKB1 are the most common known monogenic cause of common variable immunodeficiency (CVID), which results in a temporally progressive defect in the formation of immunoglobulin-producing B cells.